Clinically relevant active bleeding

The above is a clinical trial exclusion criterion. Annotated with entity spans:
Clinically relevant [Condition: active bleeding]